Platelet count of 100,000/mm3 or greater

The above is a clinical trial inclusion criterion. Annotated with entity spans:
[Measurement: Platelet count] of [Value: 100,000/mm3 or greater]